Clinical trial inclusion criterion:
• Good response to nonsteroidal anti-inflammatory drugs (NSAID)

Annotated entities:
- Drug: "nonsteroidal anti-inflammatory drugs (NSAID)"
- Observation: "Good response"